一位 15 歲女孩因為肥胖及身材矮小來醫院檢查。身體診查發現病患四肢均較小，手指尖細。據家屬所言，病患很難控制吃的慾念，常自己找食物吃，學校成績不好，但拼圖遊戲能力很強。有輕度智能障礙，還沒初經。此病人最有可能是下列何疾病？
A. 透納氏症（Turner syndrome）
B. 易脆型染色體 X 症候群（fragile X syndrome）
C. 普瑞德-威利症候群（Prader-Willi syndrome）
D. 威廉氏症候群（Williams syndrome）

正確答案：C. 普瑞德-威利症候群（Prader-Willi syndrome）